History of MDR gram-negative infection or sepsis due to organisms sensitive to colistin.

The above is a clinical trial inclusion criterion. Annotated with entity spans:
History of [Qualifier: MDR] [Condition: gram-negative infection] or [Condition: sepsis] due to [Observation: organisms] [Qualifier: sensitive to colistin].